Clinical trial exclusion criterion:
Respiratory Depression

Annotated entities:
- Condition: "Respiratory Depression"